En una paciente con artritis reumatoide en tratamiento con metotrexate, prednisona e indometacina que presenta de forma aguda edemas y aumento de la creatinina plasmática con un sedimento de orina poco expresivo y proteinuria inferior a 100 mg/24h la causa más probable es:
1. Amiloidosis renal.
2. Glomerulonefritis secundaria a la artritis reumatoide.
3. Insuficiencia renal por antiinflamatorios no esteroideos.
4. Nefritis intersticial por metotrexate.

Respuesta correcta: 3. Insuficiencia renal por antiinflamatorios no esteroideos.